Los principales vasos que regulan el flujo sanguíneo son:
1. Arterias.
2. Arteriolas.
3. Capilares.
4. Vénulas.
5. Venas.

Respuesta correcta: 2. Arteriolas.